下列何者不屬於診斷性子宮鏡之適應症？
A. 不孕症
B. 習慣性流產
C. 子宮黏膜下肌瘤
D. 子宮漿膜下肌瘤

正確答案：D. 子宮漿膜下肌瘤